Clinical trial inclusion criterion:
Low risk: Gleason <or=6 & PSA <or=10 & Clinical Stage T1b-T2a,Nx or N0, Mx or M0

Entity relations:
- Has_value("Clinical Stage", "T1b-T2a")
- Has_value("PSA", "<or=10")
- Has_value("Gleason", "<or=6")
- Subsumes("Low risk", "Gleason")
- Has_value("Clinical Stage", "Mx")
- Has_value("Clinical Stage", "Nx")
- Subsumes("Low risk", "PSA")
- Subsumes("Low risk", "Clinical Stage")
- OR("Mx", "M0")
- OR("Nx", "N0")